Plasma donation within one month of screening or any blood donation/blood loss > 500 mL within 3 months prior to screening or during the study.

The above is a clinical trial exclusion criterion. Annotated with entity spans:
[Procedure: Plasma donation] [Temporal: within one month of screening] or any [Procedure: blood donation]/[Measurement: blood loss] [Value: > 500 mL] [Temporal: within 3 months prior to screening] or [Temporal: during the study].